¿Cuál es el modelo que afirma que las conductas de salud están determinadas por la percepción de susceptibilidad personal a la enfermedad y a la gravedad percibida de las consecuencias de la enfermedad?
1. El de la acción razonada.
2. El de las creencias de salud.
3. El de la medicina psicosomática.
4. El de la vulnerabilidad al estrés.
5. El del efecto placebo.

Respuesta correcta: 2. El de las creencias de salud.